Clinical trial inclusion criterion:
Age 18 - 75 years

Entity relations:
- Has_value("Age", "18 - 75 years")